La mayoría de los linfocitos T reguladores expresan niveles altos de:
1. Moléculas de la familia B7.
2. CD8.
3. La cadena alfa del receptor para la IL-2.
4. IL-17.
5. Perforina.

Respuesta correcta: 3. La cadena alfa del receptor para la IL-2.